Clinical trial inclusion criterion:
Patient harboring a GRE or CRE bacteria

Annotated entities:
- Condition: "CRE bacteria"
- Condition: "GRE bacteria"